Patients who are legally detained in an official institution.

The above is a clinical trial exclusion criterion. Annotated with entity spans:
Patients who are [Observation: legally detained] in an [Visit: official institution].